What is BEL(Biological Expression Language) used for?

Biological Expression Language (BEL) is a novel method for statistical extraction of causal relation networks from biomedical literature.